Clinical trial inclusion criterion:
capability of understanding the investigational nature, potential risks and benefits of the clinical trial

Annotated entities:
- Post-eligibility: "capability of understanding the investigational nature, potential risks and benefits of the clinical trial"